Is participating in any other type of eye related clinical or research study

The above is a clinical trial exclusion criterion. Annotated with entity spans:
[Non-query-able: Is participating in any other type of eye related clinical or research study]